What is marked by DNaseI hypersensitive sites?

Mapping sites within the genome that are hypersensitive to digestion with DNaseI is an important method for identifying DNA elements that regulate transcription . The identification of cis-regulatory elements is central to understanding gene transcription . Of two promoter-like duplications in each spacer, only the most upstream copy is associated with hypersensitivity to DNAaseI .